Clinical trial exclusion criterion:
BMI > 30 kg.m-2,

Annotated entities:
- Measurement: "BMI"
- Value: "> 30 kg.m-2"